Which drugs are included in the CAPIRI regimen?

CAPIRI regimen includes capecitabine plus irinotecan.